Clinical trial inclusion criteria:
Histological confirmation of relapsed/refractory diffuse large B-cell lymphoma after prior rituximab and anthracycline-containing systemic treatment regimen such as R-CHOP (rituximab, cyclophosphamide, doxorubicin, vincristine, and prednisone), R-EPOCH (rituximab, etoposide phosphate, prednisone, vincristine sulfate, cyclophosphamide, doxorubicin hydrochloride), R-HyperCVAD (rituximab, cyclophosphamide, vincristine sulfate, doxorubicin hydrochloride, dexamethasone) etc.
Subjects must have received no more than 2 prior systemic therapies for lymphoma. Prior therapy with systemic rituximab monotherapy or conventional chemotherapy (i.e. bendamustine, CVP (Cyclophosphamide, Vincristine Sulfate, Prednisone) or other) ± rituximab for indolent non-Hodgkin's lymphoma (NHL) ± maintenance/extended-use rituximab will count as 1 line of systemic therapy.
Eastern Cooperative Oncology Group (ECOG) Performance status ≤ 2
Subjects must have normal organ and marrow function as defined below:
Hemoglobin ≥ 8.0 g/dl
Absolute neutrophil count ≥ 1,000/mcL
Platelet count ≥ 75,000/mcL
Total bilirubin ≤ 1.5 X the upper limit of normal (ULN) unless a known history of impaired bilirubin conjugation such as Gilbert's, for whom the maximum will be 2.5 ULN.
Aspartate transaminase (AST) (SGOT) ≤ 2.5 X institutional ULN
Alanine transaminase (ALT) (SGPT) ≤ 2.5 X institutional ULN
International normalized ratio (INR) > 1.5 ×ULN
Patients must have a calculated serum creatinine clearance > 50 mL/min using Cockcroft-Gault calculation or based on 24-hour urine collection performed within 7 days prior to treatment.
Specific guidelines will be followed regarding inclusion of relapsed/refractory DLBCL based on Hepatitis B serological testing as follow:
HBsAg negative, HBcAb negative, HBsAb positive patients are eligible.
Patients who test positive for HBsAg are ineligible
Patients with HBsAg negative, but HBcAb positive (regardless of HBsAb status) should have a HBV DNA testing performed and protocol eligibility determined as follow:
If HBV DNA is positive, the subject is ineligible.
If HBV DNA is negative, the subject may be included but must undergo HBV DNA PCR testing monthly x 3 months beginning from the start of treatment
Subjects must have the ability to understand and the willingness to sign a written informed consent document.
For women of childbearing potential: agreement to remain abstinent (refrain from heterosexual intercourse) or use a contraceptive method with a failure rate of < 1% per year during the treatment period and for at least 30 days after the last dose of venetoclax or 18 months after the last dose of rituximab, whichever is longer.
A woman is considered to be of childbearing potential if she is postmenarcheal, has not reached a postmenopausal state (< 12 continuous months of amenorrhea with no identified cause other than menopause), and has not undergone surgical sterilization (removal of ovaries and/or uterus).
For men: agreement to remain abstinent (refrain from heterosexual intercourse) or use contraceptive measures, and agreement to refrain from donating sperm, as defined below:
With female partners of childbearing potential, men must remain abstinent or use a condom plus an additional contraceptive method that together result in a failure rate of < 1% per year during the treatment period and for at least 6 months after the last dose of rituximab. Men must refrain from donating sperm during this same period.
With pregnant female partners, men must remain abstinent or use a condom during the treatment period and for at least 6 months after the last dose of rituximab to avoid exposing the embryo.

Annotated entities:
- Procedure: "Histological"
- Value: "confirmation"
- Condition: "B-cell lymphoma"
- Qualifier: "large"
- Qualifier: "diffuse"
- Procedure: "rituximab and anthracycline-containing systemic treatment regimen"
- Drug: "R-CHOP"
- Drug: "rituximab"
- Drug: "cyclophosphamide"
- Drug: "doxorubicin"
- Drug: "vincristine"
- Drug: "prednisone"
- Drug: "R-EPOCH"
- Drug: "rituximab"
- Drug: "etoposide phosphate"
- Drug: "prednisone"
- Drug: "vincristine sulfate"
- Drug: "cyclophosphamide"
- Drug: "doxorubicin hydrochloride"
- Drug: "R-HyperCVAD"
- Drug: "rituximab"
- Drug: "cyclophosphamide"
- Drug: "vincristine sulfate"
- Drug: "doxorubicin hydrochloride"
- Drug: "dexamethasone"
- Drug: "rituximab"
- Drug: "anthracycline"
- Temporal: "after"
- Reference_point: "prior rituximab and anthracycline-containing systemic treatment regimen"
- Multiplier: "no more than 2"
- Temporal: "prior"
- Procedure: "systemic therapies for lymphoma"
- Drug: "rituximab"
- Procedure: "systemic monotherapy"
- Temporal: "Prior"
- Procedure: "conventional chemotherapy"
- Drug: "bendamustine"
- Drug: "CVP"
- Drug: "Cyclophosphamide"
- Drug: "Vincristine Sulfate"
- Drug: "Prednisone"
- Drug: "rituximab"
- Condition: "non-Hodgkin's lymphoma (NHL)"
- Qualifier: "indolent"
- Drug: "rituximab"
- Qualifier: "maintenance"
- Qualifier: "extended-use"
- Measurement: "Eastern Cooperative Oncology Group (ECOG) Performance status"
- Value: "≤ 2"
- Condition: "normal organ function"
- Condition: "normal marrow function"
- Measurement: "Hemoglobin"
- Value: "≥ 8.0 g/dl"
- Measurement: "Absolute neutrophil count"
- Value: "≥ 1,000/mcL"
- Measurement: "Platelet count"
- Value: "≥ 75,000/mcL"
- Measurement: "Total bilirubin"
- Value: "≤ 1.5 X the upper limit of normal (ULN)"
- Condition: "impaired bilirubin conjugation"
- Condition: "Gilbert's"
- Value: "maximum 2.5 ULN"
- Measurement: "Aspartate transaminase (AST) (SGOT)"
- Value: "≤ 2.5 X institutional ULN"
- Measurement: "Alanine transaminase (ALT) (SGPT)"
- Value: "≤ 2.5 X institutional ULN"
- Measurement: "International normalized ratio (INR)"
- Value: "> 1.5 ×ULN"
- Measurement: "serum creatinine clearance"
- Value: "> 50 mL/min"
- Qualifier: "Cockcroft-Gault calculation"
- Qualifier: "24-hour urine collection"
- Temporal: "within 7 days prior"
- Reference_point: "treatment"
- Parsing_Error: "Specific guidelines will be followed regarding inclusion of relapsed/refractory DLBCL based on Hepatitis B serological testing as follow:"
- Measurement: "HBsAg"
- Value: "negative"
- Measurement: "HBcAb"
- Value: "negative"
- Measurement: "HBsAb"
- Value: "positive"
- Measurement: "HBsAg"
- Value: "positive"
- Grammar_Error: "are ineligible"
- Measurement: "HBsAg"
- Value: "negative"
- Measurement: "HBcAb"
- Value: "positive"
- Procedure: "HBV DNA testing"
- Parsing_Error: "Patients with HBsAg negative, but HBcAb positive (regardless of HBsAb status) should have a HBV DNA testing performed and protocol eligibility determined as follow"
- Measurement: "HBV DNA"
- Value: "positive"
- Grammar_Error: "If HBV DNA is positive, the subject is ineligible"
- Measurement: "HBV DNA"
- Value: "negative"
- Non-query-able: "must undergo HBV DNA PCR testing monthly x 3 months beginning from the start of treatment"
- Non-query-able: "Subjects must have the ability to understand and the willingness to sign a written informed consent document"
- Post-eligibility: "For women of childbearing potential: agreement to remain abstinent (refrain from heterosexual intercourse) or use a contraceptive method with a failure rate of < 1% per year during the treatment period and for at least 30 days after the last dose of venetoclax or 18 months after the last dose of rituximab, whichever is longer."
- Not_a_criteria: "A woman is considered to be of childbearing potential if she is postmenarcheal, has not reached a postmenopausal state (< 12 continuous months of amenorrhea with no identified cause other than menopause), and has not undergone surgical sterilization (removal of ovaries and/or uterus)"
- Parsing_Error: "For men: agreement to remain abstinent (refrain from heterosexual intercourse) or use contraceptive measures, and agreement to refrain from donating sperm, as defined below:"
- Non-query-able: "For men: agreement to remain abstinent (refrain from heterosexual intercourse) or use contraceptive measures, and agreement to refrain from donating sperm, as defined below:"
- Post-eligibility: "For men: agreement to remain abstinent (refrain from heterosexual intercourse) or use contraceptive measures, and agreement to refrain from donating sperm, as defined below"
- Post-eligibility: "With female partners of childbearing potential, men must remain abstinent or use a condom plus an additional contraceptive method that together result in a failure rate of < 1% per year during the treatment period and for at least 6 months after the last dose of rituximab."
- Non-query-able: "Men must refrain from donating sperm during this same period."
- Non-query-able: "With pregnant female partners, men must remain abstinent or use a condom during the treatment period and for at least 6 months after the last dose of rituximab to avoid exposing the embryo."